Clinical trial inclusion criterion:
H-pylori positive cases.

Annotated entities:
- Condition: "H-pylori positive"